Willingness to participate in all study procedures

The above is a clinical trial inclusion criterion. Annotated with entity spans:
[Non-query-able: Willingness to participate in all study procedures]